Clinical trial inclusion criterion:
No contraindication to chemoradiotherapy.

Annotated entities:
- Condition: "contraindication"
- Procedure: "chemoradiotherapy"
- Negation: "No"